Clinical trial exclusion criterion:
clinical central nervous dysfunction

Annotated entities:
- Condition: "central nervous dysfunction"